Cambios físicos visibles como la llamada “joroba de búfalo” o “cara de luna llena”, son manifestaciones de:
1. Síndrome de Wolff-Parkinson-White.
2. Síndrome de Korsakoff.
3. Síndrome de Bartter.
4. Enfermedad de Graves.
5. Síndrome de Cushing.

Respuesta correcta: 5. Síndrome de Cushing.